Clinical trial exclusion criterion:
more than mild or unstable cardiovascular disease

Entity relations:
- Has_qualifier("cardiovascular disease", "more than mild")
- OR("more than mild", "unstable")